Clinical trial inclusion criterion:
Patients must have received prior external beam radiation therapy to the region proposed for HDR brachytherapy treatment; evaluation of doses previously delivered to spinal cord/cauda equine, pelvis, and other critical structures (bowel, kidneys, rectum) will be taken into consideration.

Annotated entities:
- Procedure: "external beam radiation therapy"
- Temporal: "prior"
- Procedure: "HDR brachytherapy"
- Not_a_criteria: "evaluation of doses previously delivered to spinal cord/cauda equine, pelvis, and other critical structures (bowel, kidneys, rectum) will be taken into consideration."
- Qualifier: "to the region proposed for HDR brachytherapy treatment"